¿Cuál de los siguientes datos NO es propio de la estenosis hipertrófica del píloro?
1. Alcalosis metabólica.
2. Vómitos proyectivos de contenido bilioso.
3. Incidencia familiar.
4. Predominio del sexo masculino.
5. Masa mesoepigástrica palpable.

Respuesta correcta: 2. Vómitos proyectivos de contenido bilioso.